Clinical trial exclusion criterion:
hemoglobin level <90 g/l), thrombocytopenia <100x10^9 / L.

Annotated entities:
- Measurement: "hemoglobin level"
- Value: "<90 g/l"
- Condition: "thrombocytopenia"
- Value: "<100x10^9 / L"